Clinical trial exclusion criterion:
Hepatic or hematologic abnormality

Entity relations:
- OR("Hepatic abnormality", "hematologic abnormality")